Clinical trial exclusion criterion:
Medical condition requiring chronic use of high dose systemic corticosteroids (i.e., doses of prednisone higher than 10 mg/day or equivalent). Brief (<15 days) treatment with glucocorticoids (prednisone 100 mg by mouth daily, or equivalent) is acceptable.

Annotated entities:
- Drug: "systemic corticosteroids"
- Drug: "prednisone"
- Multiplier: "higher than 10 mg/day"
- Multiplier: "high dose"
- Condition: "Medical condition"
- Undefined_semantics: "Medical condition"
- Temporal: "chronic"
- Temporal: "<15 days"
- Drug: "glucocorticoids"
- Drug: "prednisone"
- Multiplier: "100 mg daily"
- Grammar_Error: "is acceptable"